Clinical trial inclusion criterion:
Left ventricular ejection fraction <35%

Annotated entities:
- Measurement: "Left ventricular ejection fraction"
- Value: "<35%"